Clinical trial inclusion criterion:
Serum creatinine >2.5 mg/dL within 7 days of index procedure

Entity relations:
- Has_value("Serum creatinine", ">2.5 mg/dL")
- Has_index("within 7 days of index procedure", "index procedure")
- Has_temporal("Serum creatinine", "within 7 days of index procedure")